一位50歲病人罹患慢性腎絲球腎炎20年，現出現尿毒症狀，且血中肌酸酐為11.0 mg/dL，BUN 120 mg/dL，病人選擇血液透析，下列敘述何者錯誤？
A. 長期血液透析，單次透析其尿素氮（BUN）減少的比率達到60%是足夠的
B. 大多數臺灣病人接受每週3次，每次4小時的治療
C. 所用透析液一般用重碳酸鹽來矯正尿毒病人的酸中毒（酸血症）
D. 肌肉痙攣（muscle cramps）是透析時常見的併發症

正確答案：A. 長期血液透析，單次透析其尿素氮（BUN）減少的比率達到60%是足夠的